Which application is the backbone of BioPAXViz?

BioPAXViz is a Cytoscape (version 3) application providing a comprehensive framework for metabolic pathway visualization. The application provides a visual comparative analysis of metabolic pathway topologies across pre-computed pathway phylogenomic profiles given a species phylogeny.